Clinical trial exclusion criterion:
Severe allergies

Annotated entities:
- Qualifier: "Severe"
- Condition: "allergies"